一位病人血液檢查發現血小板數目是 520,000/μL。下列何者不需列入鑑別診斷？
A. Iron deficiency anemia
B. Massive hemorrhage
C. Postoperation of ruptured appendicitis
D. Ascariasis

正確答案：D. Ascariasis